BMI = 35 or weight < 50 kg

The above is a clinical trial exclusion criterion. Annotated with entity spans:
[Measurement: BMI] [Value: = 35] or [Measurement: weight] [Value: < 50 kg]